Clinical trial exclusion criterion:
Prolonged use (more than 14 days) immunosuppressants or other immunosuppressive drugs within 6 months prior to the start of the study;

Annotated entities:
- Temporal: "more than 14 days"
- Temporal: "Prolonged use"
- Drug: "immunosuppressants"
- Qualifier: "other"
- Drug: "immunosuppressive drugs"
- Temporal: "within 6 months prior to the start of the study"